Los tremátodos:
1. Son todos monoicos.
2. Los huevos de todos ellos son operculados.
3. En su superficie ventral tienen una o más ventosas musculares.
4. Todos ellos tienen una faringe muscular.

Respuesta correcta: 3. En su superficie ventral tienen una o más ventosas musculares.